Participation in any other clinical study within the last 3 months.

The above is a clinical trial exclusion criterion. Annotated with entity spans:
[Observation: Participation in] [Qualifier: any other] clinical study [Temporal: within the last 3 months].